Clinical trial inclusion criterion:
Are currently managed at home (outpatients), are ambulatory and able to travel to the clinic. Subjects can be treated with all relevant COPD medication. This includes vaccines, inhaled short-acting beta-2-agonists as needed, short-acting or long-acting anticholinergics (tiotropium), systemic beta-2-agonists, theophylline, mucolytics, antioxidants, beta-1-agonists (for cardiovascular indication), non-invasive ventilation, long term oxygen therapy and can have Cor Pulmonale.

Annotated entities:
- Observation: "managed at home"
- Visit: "at home"
- Procedure: "managed"
- Observation: "outpatients"
- Visit: "outpatients"
- Condition: "ambulatory"
- Observation: "able to travel to the clinic"
- Drug: "COPD medication"
- Drug: "vaccines"
- Drug: "inhaled short-acting beta-2-agonists"
- Drug: "short-acting"
- Drug: "long-acting anticholinergics"
- Drug: "tiotropium"
- Drug: "systemic beta-2-agonists"
- Drug: "theophylline"
- Drug: "mucolytics"
- Drug: "antioxidants"
- Drug: "beta-1-agonists"
- Condition: "cardiovascular indication"
- Condition: "non-invasive ventilation"
- Multiplier: "long term"
- Procedure: "oxygen therapy"
- Drug: "oxygen"
- Condition: "Cor Pulmonale"